Clinical trial inclusion criterion:
ASA I - II

Annotated entities:
- Measurement: "ASA"
- Value: "I - II"